Clinical trial inclusion criterion:
ASA 1

Annotated entities:
- Condition: "ASA 1"